Clinical trial exclusion criterion:
Presence of haemodynamically significant mitral and/or aortic valve disease, except mitral regurgitation secondary to LV dilatation.

Entity relations:
- Has_qualifier("mitral valve disease", "haemodynamically significant")
- multi("secondary to LV dilatation", "LV dilatation")
- Has_qualifier("mitral regurgitation", "secondary to LV dilatation")
- Has_negation("mitral regurgitation", "except")
- AND("mitral valve disease", "mitral regurgitation")
- OR("mitral valve disease", "aortic valve disease")